Clinical trial exclusion criterion:
Inability to walk (bed-bound or wheelchair dependence)

Entity relations:
- Subsumes("Inability to walk", "bed-bound")
- OR("bed-bound", "wheelchair dependence")